50餘歲女性出現多個關節腫脹、疼痛，主要在雙手近端指間關節（PIPs）、腕關節、膝關節等，檢查結果為類風濕性關節炎（rheumatoid arthritis），其特性為何？
A. 為關節組織受侵犯，因自體免疫性淋巴細胞反應及自體免疫抗體所致
B. 因巨噬細胞功能低下所致之關節病變
C. 為風濕熱（rheumatic fever）表現之一部分
D. 為感染症之直接後遺症，引起全身關節受犯

正確答案：A. 為關節組織受侵犯，因自體免疫性淋巴細胞反應及自體免疫抗體所致